8. Failure to comply with team's recommendations (e.g. not willing to change pump parameters, follow algorithm's suggestions, etc).

The above is a clinical trial exclusion criterion. Annotated with entity spans:
[Parsing_Error: 8.] [Non-query-able: Failure to comply with team's recommendations (e.g. not willing to change pump parameters, follow algorithm's suggestions, etc).]